Medically healthy on the basis of medical history and physical examination

The above is a clinical trial inclusion criterion. Annotated with entity spans:
[Condition: Medically healthy] on the basis of [Temporal: medical history] and [Procedure: physical examination]